Clinical trial exclusion criterion:
Known diagnosis of moderate or malignant retinopathy (including retinal hemorrhage, visual disturbance and retinal microaneurysm within 6 months)

Entity relations:
- Has_qualifier("retinopathy", "moderate")
- Has_temporal("retinal hemorrhage", "within 6 months")
- Subsumes("retinopathy", "retinal hemorrhage")
- OR("retinal hemorrhage", "retinal microaneurysm", "visual disturbance")
- OR("moderate", "malignant")